Clinical trial exclusion criterion:
Contraindication to antiplatelet therapy

Entity relations:
- AND("Contraindication", "antiplatelet therapy")